Lack of safe double contraception (see 7.1)

The above is a clinical trial exclusion criterion. Annotated with entity spans:
[Pregnancy_considerations: Lack of safe double contraception (see 7.1)]